Clinical trial exclusion criterion:
Diagnosis as CD first time or first year.

Entity relations:
- Has_qualifier("CD", "first time")
- OR("first time", "first year")